younger than 18 years old

The above is a clinical trial exclusion criterion. Annotated with entity spans:
[Value: younger than 18 years] [Person: old]